Minimum joint space > 2 mm as measured on AP radiograph

The above is a clinical trial exclusion criterion. Annotated with entity spans:
[Measurement: Minimum joint space] [Value: > 2 mm] as measured on [Procedure: AP radiograph]